Clinical trial inclusion criterion:
At least one week after diagnosis OR a discrepancy of at least one week between crown-rump length and calendar gestational age

Entity relations:
- Has_index("At least one week after diagnosis", "diagnosis")
- Has_temporal("discrepancy", "at least one week between crown-rump length and calendar gestational age")
- Has_index("at least one week between crown-rump length and calendar gestational age", "crown-rump length")
- Has_index("at least one week between crown-rump length and calendar gestational age", "calendar gestational age")